有關間質性膀胱炎（interstitial cystitis）之敘述，下列何者錯誤？
A. 通常發生於40歲以上的女性
B. 通常病人的尿液常規檢查會出現血尿及膿尿
C. 常見的症狀是頻尿、夜尿、急尿、及恥骨上疼痛
D. 症狀通常是在膀胱脹尿時引起，因此膀胱容積逐漸縮小，病人變得相當頻尿

正確答案：B. 通常病人的尿液常規檢查會出現血尿及膿尿